Class-defining mutations in which genes drive FLT3-ITD-mutant AML?

NPM1, MLL, and CEBPA